Clinical trial inclusion criterion:
Patient meets protocol criteria for diagnosis of IBS-C, abdominal pain, abdominal bloating and abdominal girth

Entity relations:
- Has_qualifier("IBS-C", "protocol criteria")